Which computational methods are used for the definition of synteny?

Cinteny allows one to automatically compare multiple genomes and perform sensitivity analysis for synteny block detection. Here we present the SynBlast pipeline that is designed to construct and evaluate local synteny information. PoFF is an extension for the standalone tool Proteinortho, which enhances orthology detection by combining clustering, sequence similarity, and synteny.